Clinical trial inclusion criteria:
Subject has provided informed consent.
Subject is ≥ 18 years of age
Subject is willing and able to comply with all aspects of treatment and evaluation schedule.
Subject has known CD and a recent history (within last 2 years) of mucosal disease (diagnosis based on radiologic, endoscopic, or histological evidence).

Annotated entities:
- Non-query-able: "Subject has provided informed consent."
- Person: "age"
- Value: "≥ 18 years"
- Non-query-able: "Subject is willing and able to comply with all aspects of treatment and evaluation schedule."
- Condition: "mucosal disease"
- Observation: "radiologic evidence"
- Observation: "endoscopic evidence"
- Observation: "histological evidence"
- Temporal: "within last 2 years"
- Temporal: "recent history"
- Undefined_semantics: "CD"